Clinical trial exclusion criterion:
Pregnancy or breastfeeding

Entity relations:
- OR("Pregnancy", "breastfeeding")